Clinical trial exclusion criterion:
FibroScan within 12 months demonstrating liver stiffness of =9.5 kilo Pascal or

Entity relations:
- Has_temporal("FibroScan", "within 12 months")
- Has_value("liver stiffness", "=9.5 kilo Pascal")
- AND("FibroScan", "liver stiffness")